下列何者由腦幹神經核發出後會交叉到對側？
A. 動眼神經
B. 滑車神經
C. 舌下神經
D. 顏面神經

正確答案：B. 滑車神經